Irregular pulse, or pulse 100 or higher.

The above is a clinical trial exclusion criterion. Annotated with entity spans:
[Value: Irregular] [Measurement: pulse], or [Measurement: pulse] [Value: 100 or higher].